Clinical trial inclusion criterion:
males and females greater than or equal to 18 years of age

Entity relations:
- Has_value("age", "greater than or equal to 18 years")
- OR("males", "females")